El señor A. P. ha sido dado de alta tras ser intervenido de una resección gástrica. ¿Qué recomendaciones debe darle para evitar el síndrome de evacuación rápida?
1. Beber líquidos durante la comida.
2. Tomar una dieta con alto contenido en carbohidratos.
3. Tras la ingesta, la posición de decúbito es la más beneficiosa si el paciente la tolera.
4. Debe planear períodos de reposo de 15 minutos tras las comidas.
5. Tomar una dieta con bajo contenido en proteínas y grasas, para evitar la distensión abdominal.

Respuesta correcta: 3. Tras la ingesta, la posición de decúbito es la más beneficiosa si el paciente la tolera.